Clinical trial inclusion criterion:
Subject is at least 18 and not older than 75years old.

Entity relations:
- Has_value("old", "at least 18 and not older than 75years")